Body mass index (BMI) 18 to 30 kg/m2 inclusive

The above is a clinical trial inclusion criterion. Annotated with entity spans:
[Measurement: Body mass index (BMI)] [Value: 18 to 30 kg/m2 inclusive]